Clinical trial exclusion criterion:
Severe liver dysfunction (LFT 3X upper limit of normal)

Entity relations:
- Has_qualifier("liver dysfunction", "Severe")
- Has_value("LFT", "3X upper limit of normal")
- AND("liver dysfunction", "LFT")